Clinical trial inclusion criterion:
Patients hospitalized in medical, surgical or ICU wards

Entity relations:
- AND("hospitalized", "medical wards")
- OR("medical wards", "surgical wards", "ICU wards")